Clinical trial exclusion criterion:
Subjects with topical and/or systemic medication or mechanical devices that interfere determinedly on the results of the study (such as topical immunomodulators, punctal plugs, corticosteroids, preservative artificial tears, contact lenses).

Entity relations:
- Subsumes("topical medication", "topical immunomodulators")
- OR("topical medication", "mechanical devices", "systemic medication")
- OR("topical immunomodulators", "punctal plugs", "contact lenses", "preservative artificial tears", "corticosteroids")